Which disease is Dasatinib used to treat?

chronic myeloid leukemia